Clinical trial exclusion criterion:
endometrial hyperplasia with atypia,

Annotated entities:
- Condition: "endometrial hyperplasia"
- Qualifier: "with atypia"